一位 38 歲女性，最近一週來發燒、畏寒及右上腹絞痛。檢查發現她有黃疸現象且血中結合型膽紅素濃度過高。腹部超音波檢查發現有膽囊結石與總膽管擴張的現象。此外在肝臟也可以看到三個約 1 至 2 公分的囊狀病變。下列何者最可能造成上述變化？
A. Clonorchis sinensis
B. Entamoeba histolytica
C. Escherichia coli
D. Salmonella typhi

正確答案：C. Escherichia coli